抗真菌感染最主要的天然防禦因素是：
A. 皮膚與黏膜
B. 嗜中性白血球（neutrophil）
C. 巨噬細胞（macrophage）
D. 補體（complement）

正確答案：A. 皮膚與黏膜